Clinical trial exclusion criterion:
Known cerebral/meningeal disease including signs or symptoms of progressive multifocal leukoencephalopathy (PML)

Annotated entities:
- Condition: "meningeal disease"
- Condition: "cerebral disease"
- Condition: "progressive multifocal leukoencephalopathy"
- Condition: "PML"